根據2006年美國麻醉醫師學會操作指引（The American Society of Anesthesiologists Practice Guidelines，2006），建議病人需要輸血操作條件之敘述，何者錯誤？
A. 病人血色素小於6 g/dL的病人，特別是急性貧血情況，幾乎是所有病人都達到需要進行緊急輸血的條件
B. 病人血色素大於10 g/dL時，原則幾乎不必考慮輸血
C. 當病人血色素介於6～10 g/dL之間，應由病人發生缺氧併發症的風險，決定是否輸紅血球
D. 病人在使用異體輸血（allogeneic RBCs）為病人輸血所設定的適應症，應較使用自體輸血（autologous RBCs）時更有寬鬆且自由，因為前者異體輸血的安全性較高

正確答案：D. 病人在使用異體輸血（allogeneic RBCs）為病人輸血所設定的適應症，應較使用自體輸血（autologous RBCs）時更有寬鬆且自由，因為前者異體輸血的安全性較高